Clinical trial exclusion criteria:
Patients with documented allergies to propofol, dexmedetomidine, fentanyl, eggs or egg products, or soy or soy products.
A heart rate less than 50 beats/minute or grade 2 or 3 AV heart block
Mean arterial pressure less than 55 mmHg despite appropriate fluid resuscitation and vasopressor support.
Current triglyceride level > 400 mg/dl

Annotated entities:
- Condition: "allergies"
- Drug: "propofol"
- Drug: "dexmedetomidine"
- Drug: "fentanyl"
- Observation: "eggs"
- Observation: "egg products"
- Observation: "soy"
- Observation: "soy products"
- Measurement: "heart rate"
- Value: "less than 50 beats/minute"
- Condition: "AV heart block"
- Qualifier: "grade 2"
- Qualifier: "grade 3"
- Measurement: "Mean arterial pressure"
- Value: "less than 55 mmHg"
- Procedure: "fluid resuscitation"
- Procedure: "vasopressor"
- Measurement: "triglyceride level"
- Value: "> 400 mg/dl"